下列有關遺傳性免疫缺失疾病（immunodeficiency diseases）的敘述，何者錯誤？
A. autoimmune polyendocrinopathy-candidiasis-ectodermal dystrophy（APECED）是因為AIRE基因缺陷所造成
B. bare lymphocyte syndrome的病人是因為MHC class II無法表現，所以體內CD4 T細胞數目雖正常但表面沒有
C. Omenn syndrome常因為是RAG1或RAG2基因突變
D. 如果是白血球先天性缺陷造成的疾病，造血幹細胞移植是可行的療法

正確答案：B. bare lymphocyte syndrome的病人是因為MHC class II無法表現，所以體內CD4 T細胞數目雖正常但表面沒有